Subjects are allowed to have received, but are not required to have received:

The above is a clinical trial inclusion criterion. Annotated with entity spans:
[Parsing_Error: Subjects are allowed to have received, but are not required to have received:]